Las hormonas tiroideas:
1. Se almacenan en la tiroides.
2. Se unen mayoritariamente a receptores de membrana.
3. La más potente es la tiroxina.
4. Se transportan en forma libre en el plasma.

Respuesta correcta: 1. Se almacenan en la tiroides.